Clinical trial exclusion criterion:
aged less than 20 years

Entity relations:
- Has_value("aged", "less than 20 years")